Clinical trial inclusion criterion:
11. Target lesions(s) is (are) located in an infarct (if not treated with primary PCI) or non-infarct-related artery with a 70% or greater stenosis (by visual estimate) more than 72 hours following the ST segment elevation myocardial infarction (STEMI).

Annotated entities:
- Condition: "Target lesions"
- Condition: "infarct"
- Qualifier: "in an infarct -related artery"
- Procedure: "primary PCI"
- Negation: "not"
- Qualifier: "non-infarct-related artery"
- Value: "70% or greater"
- Measurement: "stenosis"
- Condition: "stenosis"
- Temporal: "more than 72 hours following the ST segment elevation myocardial infarction (STEMI)"
- Reference_point: "the ST segment elevation myocardial infarction (STEMI)"
- Condition: "ST segment elevation myocardial infarction (STEMI)"